Women who are pregnant or nursing/breastfeeding.

The above is a clinical trial exclusion criterion. Annotated with entity spans:
[Person: Women] who are [Condition: pregnant] or [Condition: nursing]/[Observation: breastfeeding].